神經內分泌腫瘤發生肝轉移時，下列那一個情況最不適合選擇肝臟切除手術？
A. 可切除95%以上的肝臟腫瘤體積
B. ⻑效體抑素作用類似物（long-acting somatostatin analogues）治療無效
C. 有明顯神經內分泌症狀
D. 病人的肝功能為Child-Pugh class B

正確答案：D. 病人的肝功能為Child-Pugh class B